關於GnRH（gonadotropin releasing hormone）之敘述，下列何者錯誤？
A. GnRH無法刺激腦下垂體分泌FSH，只能刺激腦下垂體分泌LH
B. GnRH的分泌是脈衝性的方式（pulsatile fashion），也就是每隔一段時間才會分泌一次
C. GnRH是含有10個胺基酸的蛋白質分子
D. GnRH在體內代謝的半衰期很短，只有2～4分鐘

正確答案：A. GnRH無法刺激腦下垂體分泌FSH，只能刺激腦下垂體分泌LH